Clinical trial inclusion criterion:
Adults 18-65 years, who are diagnosed with functional neurologic symptom or conversion disorder. If diagnosis of seizure type then video EEG with diagnosis confirmed by board-certified neurologist with subspecialty training in epilepsy and clinical neurophysiology using the criteria of the International Classification of the Epilepsies is required. If diagnosis of motor type, documented and clinically established levels of diagnostic certainty (Williams,1995) confirmed by 2 neurologists is required.

Entity relations:
- Has_value("18-65 years", "18-65 years")
- AND("video EEG", "criteria of the International Classification of the Epilepsies")
- AND("seizure type", "video EEG")
- OR("functional neurologic symptom", "conversion disorder")